Clinical trial exclusion criterion:
Pregnant women or women with potential childbearing

Entity relations:
- OR("Pregnant", "potential childbearing")
- OR("women", "women")